Clinical trial inclusion criterion:
ECOG Performance status0-2

Annotated entities:
- Measurement: "ECOG Performance status"
- Value: "0-2"